patients with known allergy to study medications.

The above is a clinical trial exclusion criterion. Annotated with entity spans:
patients with known [Condition: allergy] to [Drug: study medications].